contraceptive injection

The above is a clinical trial exclusion criterion. Annotated with entity spans:
[Device: contraceptive injection]